Major surgery within 1 month;

The above is a clinical trial exclusion criterion. Annotated with entity spans:
[Procedure: Major surgery] [Value: within 1 month];